Type 2 DM

The above is a clinical trial inclusion criterion. Annotated with entity spans:
[Condition: Type 2 DM]